Clinical trial exclusion criterion:
Already receiving chronic analgesic therapy for a separate chronic pain condition

Annotated entities:
- Procedure: "analgesic therapy"
- Qualifier: "chronic"
- Condition: "chronic pain"
- Qualifier: "separate"